Clinical trial inclusion criteria:
age>18 years
critical limb ischemia (Rutherford class 4-6)
angiographic stenosis>50% or occlusion of at least one tibial vessel of at least 40mm for which an interventional treatment is scheduled

Annotated entities:
- Person: "age"
- Value: ">18 years"
- Condition: "limb ischemia"
- Measurement: "Rutherford class"
- Value: "4-6"
- Qualifier: "critical"
- Measurement: "angiographic stenosis"
- Value: ">50%"
- Condition: "occlusion"
- Multiplier: "at least one"
- Qualifier: "tibial vessel"
- Qualifier: "at least 40mm"
- Procedure: "interventional treatment"
- Mood: "scheduled"